病人經檢查後發現為第3期直腸癌，下列何者為現階段之治療選項？
A. 術前單獨放射線治療
B. 術前單獨化學藥物治療
C. 術前放射線合併化學藥物治療
D. 直接手術切除治療

正確答案：C. 術前放射線合併化學藥物治療